Are able to comprehend and sign a written informed consent

The above is a clinical trial inclusion criterion. Annotated with entity spans:
Are [Observation: able to comprehend] and sign a written informed consent